Clinical trial exclusion criterion:
Delirium at screening or baseline

Entity relations:
- Has_temporal("Delirium", "at screening")
- OR("at screening", "at baseline")